En el oído humano:
1. Los estereocilios de las células sensoriales están bañados por perilinfa.
2. El estribo encaja sobre la ventana redonda.
3. Las células sensoriales están sobre la membrana de Reissner.
4. Las células receptoras sinaptan con fibras del VIII par craneal.
5. El helicotrema comunica las rampas media y timpánica.

Respuesta correcta: 4. Las células receptoras sinaptan con fibras del VIII par craneal.